Un paciente mediante su receta electrónica compra en una Oficina de Farmacia su medicamento con aportación reducida, para la diabetes tipo I cuyo PVP es 62,40 €. ¿Cuánto debe cobrar el farmacéutico?:
1. 8,23 €.
2. 6,24 €.
3. 4,24 €.
4. 62,40 €.

Respuesta correcta: 3. 4,24 €.